Clinical trial exclusion criterion:
Any previous treatments for active CSC;

Entity relations:
- Has_qualifier("CSC", "active")
- AND("treatments", "CSC")
- Has_temporal("treatments", "previous")